Clinical trial exclusion criterion:
History of knee surgery in the target knee;

Entity relations:
- Has_index("knee surgery", "target knee")
- Has_temporal("knee surgery", "History")